Clinical trial exclusion criterion:
receiving medication that could interfere with the study protocol objectives (hormonal contraceptives, androgens, prednisone, thyroid hormones, insulin)

Entity relations:
- Has_qualifier("medication", "could interfere with the study protocol objectives")
- Subsumes("medication", "hormonal contraceptives")
- Has_temporal("medication", "receiving")
- OR("hormonal contraceptives", "thyroid hormones", "prednisone", "androgens", "insulin")